Known other respiratory disorders or signs for other respiratory disorders (e.g. asthma, lung cancer, sarcoidosis, tuberculosis, lung fibrosis, cystic fibrosis, bronchoectasis).

The above is a clinical trial exclusion criterion. Annotated with entity spans:
Known other [Condition: respiratory disorders] or [Condition: signs for] other respiratory disorders (e.g. [Condition: asthma], [Condition: lung cancer], [Condition: sarcoidosis], [Condition: tuberculosis], [Condition: lung fibrosis], [Condition: cystic fibrosis], [Condition: bronchoectasis]).